What is the microgenderome?

The sexually dimorphic microbiome has been termed the 'microgenderome'.